Any immunosuppressive disorder, such as HIV infection, common variable immunodeficiency, active cancers or chemotherapy.

The above is a clinical trial exclusion criterion. Annotated with entity spans:
Any [Condition: immunosuppressive disorder], such as [Condition: HIV infection], [Condition: common variable immunodeficiency], [Temporal: active] [Condition: cancers] or [Procedure: chemotherapy].